Prolonged cardiopulmonary resuscitation (> 2 minutes) within the past 2 weeks

The above is a clinical trial exclusion criterion. Annotated with entity spans:
[Qualifier: Prolonged] [Condition: cardiopulmonary resuscitation] (> 2 minutes) within the [Temporal: past 2 weeks]